¿Qué efecto tiene la estimulación simpática sobre la frecuencia cardíaca?:
1. La aumenta, con lo que aumenta el gasto cardíaco.
2. Las disminuye, por lo que disminuye el gasto cardíaco.
3. No afecta a la frecuencia cardiaca.
4. Tiene efecto doble, primero la disminuye y después la aumenta.

Respuesta correcta: 1. La aumenta, con lo que aumenta el gasto cardíaco.